How much should be the duration of the QT interval in patients with short QT syndrome?

The short-QT syndrome is characterized by QT intervals <300-330 msec